懷孕期間，子宮平滑肌細胞因受到內分泌刺激之影響，其細胞變化為：
A. 增生，不肥大
B. 肥大，不增生
C. 增生且肥大
D. 不增生，不肥大

正確答案：C. 增生且肥大